Clinical trial inclusion criterion:
Normal organ function within 14 days of study entry

Annotated entities:
- Condition: "Normal organ function"
- Temporal: "within 14 days of study entry"
- Reference_point: "study entry"